List the attenuated live viruses contained in the Fluzone intradermal quadrivalent vaccine.

The Fluzone Intradermal Quadrivalent vaccine contains 9 ug hemagglutinin per strain of the two A-strain viruses and both B-strain lineage viruses (Victoria and Yamagata).